Clinical trial inclusion criterion:
Easten Cooperative Oncology Group score = 2

Entity relations:
- Has_value("Easten Cooperative Oncology Group score", "= 2")